Excessive alcohol use (>14 drinks/week)

The above is a clinical trial exclusion criterion. Annotated with entity spans:
Excessive [Observation: alcohol use] ([Multiplier: >14 drinks/week])